在坐骨棘（ischial spine）處施行陰部神經阻斷術（pudendal nerve block）時，下列何處的感覺最可能受到影響？
A. 陰道上端（upper vagina）
B. 陰阜（mons pubis）
C. 陰道前庭（vestibule of vagina）
D. 子宮（uterus）

正確答案：C. 陰道前庭（vestibule of vagina）